Clinical trial inclusion criterion:
Patients who are eligible for intracoronary stenting

Annotated entities:
- Procedure: "intracoronary stenting"